Clinical trial inclusion criterion:
Signed written informed consent

Annotated entities:
- Informed_consent: "Signed written informed consent"